Clinical trial inclusion criterion:
aged between 20 and 80

Entity relations:
- Has_value("aged", "between 20 and 80")